巴金森症候群（Parkinsonism）之病人，如合併有坐立不安之恒動症（akathisia）時，最可能的診斷是：
A. 原發性巴金森氏病（idiopathic Parkinson's disease）
B. 藥物引起（drug-induced）的巴金森症候群
C. 進行性核上性麻痺（progressive supranuclear palsy）
D. 紋狀體黑質退化症（striatonigral degeneration）

正確答案：B. 藥物引起（drug-induced）的巴金森症候群